The patients have severe non-cancerous diseases.

The above is a clinical trial exclusion criterion. Annotated with entity spans:
The patients have [Qualifier: severe] [Condition: non-cancerous diseases].